Clinical trial inclusion criterion:
Have symptoms of both stress and urgency urinary incontinence

Annotated entities:
- Condition: "urgency urinary incontinence"
- Condition: "stress urinary incontinence"